Clinical trial exclusion criterion:
Heart failure stage D as defined by American Heart Association (7).

Entity relations:
- Has_value("stage", "D")
- Has_qualifier("stage", "American Heart Association")
- AND("Heart failure", "stage")